70歲男性，有高血壓、冠心症，某日在工作時突發左眼幾乎看不見，症狀持續約20分鐘後視力逐漸恢復，若為血管疾病則最可能的病變血管為何？
A. 前大腦動脈（anterior cerebral artery）
B. 中大腦動脈（middle cerebral artery）
C. 後大腦動脈（posterior cerebral artery）
D. 內頸動脈（internal carotid artery）

正確答案：D. 內頸動脈（internal carotid artery）